Clinical trial inclusion criterion:
Eligible for surgery with curative intent

Entity relations:
- Has_qualifier("surgery", "curative")